下列寄生蟲之配對，其生活史中皆無囊體期（cyst stage）者為何？
A. 麥氏唇鞭毛蟲（Chilomastix mesnili）及陰道滴蟲（Trichomonas vaginalis）
B. 雙核阿米巴（Dientamoeba fragilis）及腸道滴蟲［Trichomonas（Pentatrichomonas）
C. 大腸纖毛蟲（Balantidium coli）及齒齦阿米巴（Entamoeba gingivalis）
D. 嗜碘阿米巴（Iodamoeba bütschlii）及口腔滴蟲（Trichomonas tenax）

正確答案：B. 雙核阿米巴（Dientamoeba fragilis）及腸道滴蟲［Trichomonas（Pentatrichomonas）